能製造白喉毒素的白喉桿菌具有下列何項特質？
A. 為不溶血菌落
B. 具有莢膜
C. 具有潛溶性的β-噬菌體
D. 能代謝尿素

正確答案：C. 具有潛溶性的β-噬菌體